What is the role of phenylbutyrate–taurursodiol for amyotrophic lateral sclerosis?

Treatment of amyotrophic lateral sclerosis patients with phenylbutyrate–taurursodiol was associated with both functional and survival benefits.